Clinical trial inclusion criterion:
DSM-IV or DSM-5 diagnosis of schizophrenia or schizoaffective disorder

Annotated entities:
- Qualifier: "DSM-IV"
- Qualifier: "DSM-5"
- Condition: "schizophrenia"
- Condition: "schizoaffective disorder"